Clinical trial inclusion criterion:
Meets the Diagnostic and Statistical Manual (DSM) IV and DSM-V diagnostic criteria for generalised anxiety disorder (GAD) based on structured interview (Mini International Neuropsychiatric Interview-Plus 6 [MINI-Plus 6]. Note that while the MINI-Plus 6 uses the DSM-IV criteria, the same criteria are used in the DSM-V).

Annotated entities:
- Measurement: "Diagnostic and Statistical Manual (DSM) IV and DSM-V diagnostic criteria"
- Condition: "generalised anxiety disorder"
- Condition: "GAD"
- Procedure: "structured interview"
- Procedure: "Mini International Neuropsychiatric Interview-Plus 6 [MINI-Plus 6]"